下列何種藥物與病毒包膜蛋白結合，使得病毒與宿主細胞膜無法融合？
A. Ribavirin
B. Adefovir
C. Enfuvirtide
D. Abacavir

正確答案：C. Enfuvirtide